Krukenberg 腫瘤是指某些消化道之原發癌轉移至：
A. 肝臟
B. 肺臟
C. 脾臟
D. 卵巢

正確答案：D. 卵巢